Clinical trial exclusion criterion:
Patients refuse to follow the research

Annotated entities:
- Observation: "refuse to follow the research"